Which gene is responsible for the Liebenberg syndrome?

Liebenberg syndrome is a genetic disease caused by heterozygous mutations or deletions of the zinc finger E-box-binding homeodomain complex 1 (PITX1) gene.